American Society of Anesthesiologists Status 1 -3

The above is a clinical trial inclusion criterion. Annotated with entity spans:
[Measurement: American Society of Anesthesiologists Status] [Value: 1 -3]